臨床移植術前免疫學評估的 preformed antibody 和下列何者術後免疫或臨床現象最有相關？
A. hyperacute rejection
B. acute rejection
C. chronic rejection
D. acute tubular necrosis of kidney

正確答案：A. hyperacute rejection